Mientras el Sr. L. K. de 52 años, natural de un país centroeuropeo y residente en España desde hace 4 meses y 20 días, le informa de las dificultades de integración en la sociedad española que tiene debido a que los que “hablan español no hacen ningún esfuerzo por entenderle y él habla muy poco el idioma español y, además, tiene un montón de barreras idiomáticas para entenderse en el trabajo y hacer amigos”, está usted valorando el patrón funcional de salud:
1. Adaptación – Tolerancia al estrés.
2. Cognitivo – Perceptual.
3. Rol – Relaciones.
4. Comunicación – Pertenencia a Grupos.
5. Percepción – Manejo de la Salud.

Respuesta correcta: 3. Rol – Relaciones.